Clinical trial exclusion criterion:
chronic renal failure on dialysis

Annotated entities:
- Condition: "chronic renal failure"
- Procedure: "dialysis"